在一個以預防吸菸為主題的健康教育活動中，老師運用價值澄清、影片欣賞、角色扮演等不同的教學方法幫 助學生熟習「拒絕的技巧」，日後學生遇到類似如別人勸酒或邀約吸毒的情境時，可以運用學會的拒絕技巧，是應用下列何種行為改變的技術？
A. 互相抵制原理
B. 逐減敏感原理
C. 類化原理
D. 增強原理

正確答案：C. 類化原理